How are super enhancers defined?

Super-enhancers (SEs) are large clusters of transcriptional enhancers that drive expression of genes controlling cell identity.